Surgery involving the eye, eyebrow, forehead, or frontal scalp near the sensor placement

The above is a clinical trial exclusion criterion. Annotated with entity spans:
[Procedure: Surgery] involving the [Qualifier: eye], [Qualifier: eyebrow], [Qualifier: forehead], or [Qualifier: frontal scalp] [Non-representable: near the sensor placement]